Patients with clinically unstable cardiac arrhythmias, such as recurrent ventricular tachycardia.

The above is a clinical trial exclusion criterion. Annotated with entity spans:
Patients with [Qualifier: clinically unstable] [Condition: cardiac arrhythmias], such as [Multiplier: recurrent] [Condition: ventricular tachycardia].